Los átomos de hierro de la hemoglobina están unidos a la cadena peptídica a través del aminoácido:
1. Prolina.
2. Triptófano.
3. Arginina.
4. Histidina.

Respuesta correcta: 4. Histidina.